肝臟粒線體內 HMG-CoA synthase 合成酶的主要功能為下列何者？
A. 促進膽固醇合成（Cholesterol biosynthesis）
B. 抑制脂肪酸合成（Fatty acid biosynthesis）
C. 促進酮體合成（Ketone body biosynthesis）
D. 促進糖質新生（Gluconeogenesis）

正確答案：C. 促進酮體合成（Ketone body biosynthesis）